Treatment with insulin

The above is a clinical trial exclusion criterion. Annotated with entity spans:
Treatment with [Drug: insulin]